Clinical trial inclusion criteria:
Women aged 25-75 years old.
Women with recently diagnosed breast cancer and who will receive NAC to reduce tumor burden before surgery. (including locally advanced breast cancer (LABC) according to clinical assessment; or tumor size > 2cm, that is, at least T2 in TNM staging).

Annotated entities:
- Person: "Women"
- Person: "aged"
- Value: "25-75 years old"
- Person: "Women"
- Condition: "breast cancer"
- Procedure: "NAC"
- Qualifier: "reduce tumor burden"
- Temporal: "before surgery"
- Reference_point: "surgery"